82歲的男性，近日服用感冒藥，因解尿困難來到泌尿外科門診，經你單次導尿，導出750毫升的尿液，病人懷疑是其他科醫師開立感冒藥的關係，你發現的確含有抗副交感神經 （anticholinergic）類的藥物，依你的專業與經	判斷也懷疑是該藥物所造成的。此時應該要如何告知病人？
A. 儘量幫其他的同僚隱瞞，告訴病人不可能，以維護你與同儕的關係
B. 告訴病人這種藥依經	從來不會有尿滯留的問題，應是病人的特殊體質
C. 與病人站在同一陣線，指責前一位醫師的錯誤與疏忽，甚至告知病人可以向醫院申訴
D. 誠實告訴病人，以後儘量不要使用這類藥物，同時告知病人，看病時要告訴醫師原有的疾病，才能避免不必要的副作用

正確答案：D. 誠實告訴病人，以後儘量不要使用這類藥物，同時告知病人，看病時要告訴醫師原有的疾病，才能避免不必要的副作用